Clinical trial exclusion criteria:
Suspect or certainty of fetal malformation,
Presence of conditions such as preeclampsia, multiparity, preterm labor
History of adverse reaction to a-2 adrenergic agonists
Nicotine addiction
Chronic use of opioid

Annotated entities:
- Condition: "fetal malformation"
- Mood: "certainty"
- Mood: "Suspect"
- Condition: "preeclampsia"
- Condition: "multiparity"
- Condition: "preterm labor"
- Condition: "adverse reaction"
- Drug: "a-2 adrenergic agonists"
- Condition: "Nicotine addiction"
- Multiplier: "Chronic use"
- Drug: "opioi"